Pathologic confirmation of lung adenocarcinoma with measurable disease, defined as at least one lesion that can be accurately measured in at least one dimension (longest diameter to be recorded on CT); Patients must have previously untreated locally advanced or metastatic NSCLC; Patients must have lung cancer with a documented EGFR activating mutation (exon 19 deletion, L858R).

The above is a clinical trial inclusion criterion. Annotated with entity spans:
[Line: Pathologic confirmation of lung adenocarcinoma with measurable disease, defined as at least one lesion that can be accurately measured in at least one dimension (longest diameter to be recorded on CT)]; [Line: Patients must have previously untreated locally advanced or metastatic NSCLC]; [Line: Patients must have lung cancer with a documented EGFR activating mutation (exon 19 deletion, L858R).]